Clinical trial exclusion criterion:
Significant cognitive impairment, defined as a known diagnosis of dementia or a Mini-Mental State Examination exam score < 24

Entity relations:
- Has_qualifier("cognitive impairment", "Significant")
- Has_value("Mini-Mental State Examination", "score < 24")
- OR("cognitive impairment", "Mini-Mental State Examination", "dementia")